Clinical trial exclusion criterion:
Severe impairment of liver or pancreatic function.

Annotated entities:
- Condition: "impairment of liver"
- Condition: "impairment of pancreatic function"
- Qualifier: "Severe"